Women with ongoing pregnancy or who are breast feeding.

The above is a clinical trial exclusion criterion. Annotated with entity spans:
[Person: Women] with [Temporal: ongoing] [Condition: pregnancy] or who are [Observation: breast feeding].